2. Has not had a GTC seizure within the last year AND is not expected to have a reduction of anti-epileptic drugs during their hospital admission.

The above is a clinical trial exclusion criterion. Annotated with entity spans:
[Parsing_Error: 2.] Has [Negation: not] had a [Condition: GTC seizure] [Temporal: within the last year] AND is [Negation: not] expected to have a [Procedure: reduction of anti-epileptic drugs] [Temporal: during their hospital admission].